What is the Orco protein in mosquitos?

Odorant co-receptor.